Body mass index > 35 and < 50 kg/m2

The above is a clinical trial inclusion criterion. Annotated with entity spans:
[Measurement: Body mass index] [Value: > 35 and < 50 kg/m2]